Clinical trial exclusion criteria:
Pediatric patients (under 18 years) Pregnancy Patients who are unresponsive at baseline, who have neurologic deficits at baseline, or who are allergic to dexmedetomidine

Annotated entities:
- Person: "Pediatric"
- Value: "under 18 years"
- Person: "years"
- Line: "Patients who are unresponsive at baseline, who have neurologic deficits at baseline, or who are allergic to dexmedetomidine"
- Line: "Pediatric patients (under 18 years)"
- Condition: "Pregnancy"
- Line: "Pregnancy"
- Observation: "unresponsive"
- Temporal: "at baseline"
- Condition: "neurologic deficits"
- Temporal: "at baseline"
- Condition: "allergic"
- Drug: "dexmedetomidine"